Clinical trial inclusion criterion:
Histological diagnosis of high grade glandular epithelial neoplasia (Vienna 4-1 to 4-46), possibly multifocal or stage 0 (Tis, N0, M0),

Entity relations:
- Has_value("Vienna", "4-1 to 4-46")
- Subsumes("high grade", "Vienna")
- Has_qualifier("glandular epithelial neoplasia", "high grade")
- AND("glandular epithelial neoplasia", "Histological diagnosis")
- Has_value("stage", "0")
- Has_value("T", "is")
- Has_value("N", "0")
- Has_value("M", "0")
- Subsumes("stage", "T")
- Has_qualifier("glandular epithelial neoplasia", "multifocal")
- AND("glandular epithelial neoplasia", "stage")